Clinical trial inclusion criterion:
Male and female Active-duty SMs or Veterans aged 18 or older who are in good general health.

Annotated entities:
- Person: "Male"
- Person: "female"
- Person: "Active-duty SMs"
- Person: "Veterans"
- Value: "18 or older"
- Person: "aged"
- Condition: "good general health"